Clinical trial inclusion criterion:
Aged between 18 and 40 years

Annotated entities:
- Person: "Aged"
- Value: "between 18 and 40 years"